Informed consent form has been signed and dated by the parent(s) or other legally acceptable representative(s) (if applicable)

The above is a clinical trial inclusion criterion. Annotated with entity spans:
[Non-query-able: Informed consent form has been signed and dated by the parent(s) or other legally acceptable representative(s) (if applicable)]